Clinical trial exclusion criterion:
Suffering from a movement disorder that could mimic or confound the accurate diagnosis of RLS (eg, Tourette's syndrome, tic disorder, periodic limb movement disorder [PLMD], sleep disorders).

Entity relations:
- Subsumes("periodic limb movement disorder", "PLMD")
- Subsumes("movement disorder", "Tourette's syndrome")
- OR("Tourette's syndrome", "tic disorder", "periodic limb movement disorder", "sleep disorders")